一名 58 歲女性因骨盆腔腫瘤行剖腹探查，術中發現惡性卵巢腫瘤，因此行子宮全切除術、兩側卵巢輸ND 卵管切除、網膜切除術、兩側骨盆腔淋巴腺切除，所有可見腫瘤都完全切除。病理檢查發現兩側卵巢皆有癌細胞浸潤，其他部分皆無。腹水細胞學檢查可見惡性細胞。則此名病人卵巢癌之分期（stage）為：
A. Ib
B. Ic
C. IIb
D. IIc

正確答案：B. Ic